En un diseño cuasiexperimental:
1. No hay una intervención específica del investigador sobre la variable independiente o tratamiento.
2. Se estudia la conducta espontánea en situaciones naturales.
3. Constituye el grado máximo de intervención y control interno.
4. Los grupos de estudio no se pueden organizar por asignación aleatoria.
5. Representa el grado máximo de naturalidad y el mínimo control interno.

Respuesta correcta: 4. Los grupos de estudio no se pueden organizar por asignación aleatoria.